Subjects who need to take the medicine which is prohibited during this study

The above is a clinical trial exclusion criterion. Annotated with entity spans:
Subjects who [Non-query-able: need to take] [Context_Error: the medicine which is prohibited during this study]